Clinical trial inclusion criterion:
History of gastro-intestinal or other organ bleeding

Entity relations:
- Has_qualifier("organ bleeding", "other")
- Has_temporal("gastro-intestinal bleeding", "History")
- OR("gastro-intestinal bleeding", "organ bleeding")